Why does the prodrug amifostine (ethyol) create hypoxia?

After the administration of Prodrug amifostine the cells of the tissue prefer anaerobic glycolysis rather than regular cellular aerobic respiration. By the beggining of anaerobic glycolysis the inducible by hypoxia proteins are induced and by all these molecules  the hypoxic conditions consist of.